Clinical trial exclusion criterion:
Patients with active GIT bleeding.

Annotated entities:
- Qualifier: "active"
- Condition: "GIT bleeding"